Menopausal women with breast cancer treated and using tamoxifen or aromatase inhibitor.

The above is a clinical trial inclusion criterion. Annotated with entity spans:
[Condition: Menopausal] [Person: women] with [Condition: breast cancer] [Procedure: treated] and using [Drug: tamoxifen] or [Drug: aromatase inhibitor].